Diagnosed psychiatric or cognitive disorders

The above is a clinical trial exclusion criterion. Annotated with entity spans:
Diagnosed [Condition: psychiatric] or [Condition: cognitive disorders]